non-valvular atrial fibrillation

The above is a clinical trial inclusion criterion. Annotated with entity spans:
[Qualifier: non-valvular] [Condition: atrial fibrillation]